Clinical trial inclusion criterion:
Previous pregnancy complicated by gestational diabetes

Annotated entities:
- Condition: "gestational diabetes"
- Condition: "pregnancy"